Clinical trial exclusion criterion:
Subjects with a history of drug or alcohol abuse within the past 6 months

Entity relations:
- Has_index("within the past 6 months", "the past 6 months")
- Has_temporal("drug abuse", "history of")
- Has_temporal("drug abuse", "within the past 6 months")
- OR("drug abuse", "alcohol abuse")